60歲男性，有高血壓與糖尿病的病史，因急性神經症狀就醫，腦部磁振照影檢查顯示為急性小洞梗塞（lacunar infarction），下列那些是小洞梗塞中風常見的典型症狀：①肢體失調 （dysmetria） ②失語（aphasia） ③ 構音困難（dysarthria） ④忽略（neglect）
A. ①③
B. ②④
C. ①④
D. ②③

正確答案：A. ①③